Use intrauterine contraceptive device.

The above is a clinical trial exclusion criterion. Annotated with entity spans:
Use [Device: intrauterine contraceptive device].